Clinical trial inclusion criterion:
Patients who have been on a tumor necrosis factor alpha (TNFa) inhibitor (not more than one) must have experienced an inadequate response to previous or current treatment given at an approved dose for at least 3 months prior to baseline or had been intolerant upon administration of an anti-TNFa agent

Entity relations:
- Has_multiplier("tumor necrosis factor alpha (TNFa) inhibitor", "not more than one")
- Has_temporal("approved dose", "for at least 3 months prior to baseline")
- Has_temporal("treatment", "previous")
- AND("inadequate response", "treatment")
- Has_multiplier("treatment", "approved dose")
- AND("intolerant", "anti-TNFa agent")
- AND("tumor necrosis factor alpha (TNFa) inhibitor", "inadequate response")
- OR("previous", "current")
- OR("inadequate response", "intolerant")